Clinical trial inclusion criteria:
bariatric surgery patients
laparoscopic roux-en-y gastric bypass
use of EEA stapler anastomosis

Annotated entities:
- Procedure: "bariatric surgery"
- Procedure: "roux-en-y gastric bypass"
- Qualifier: "laparoscopic"
- Device: "EEA stapler anastomosis"